Which molecule is targeted by a monoclonal antibody Mepolizumab?

Mepolizumab is a humanized monoclonal antibody that binds to and inactivates interleukin-5 that has been shown to reduce asthma exacerbations in patients with severe eosinophilic asthma.